Acute Myocardial Infarction Undergoing Primary percutaneous coronary intervention.

The above is a clinical trial inclusion criterion. Annotated with entity spans:
[Condition: Acute Myocardial Infarction] Undergoing [Procedure: Primary percutaneous coronary intervention].